Clinical trial inclusion criterion:
First presentation of AIH requiring treatment according to the current EASL guidelines

Annotated entities:
- Measurement: "EASL guidelines"
- Procedure: "treatment"
- Condition: "AIH"